La creatina fosfato:
1. Es un compuesto de baja energía de hidrólisis.
2. Es un compuesto de almacenamiento de energía en el riñón.
3. Se forma a partir de la ornitina.
4. Es un compuesto de almacenamiento de energía en el músculo.
5. Se forma a partir de la tirosina.

Respuesta correcta: 4. Es un compuesto de almacenamiento de energía en el músculo.